下列何者非腹腔鏡膽囊切除術之禁忌症？
A. 無法控制之凝血機能障礙
B. 嚴重之阻塞性肺病
C. 嚴重之心臟衰竭
D. 先前接受過腹部手術

正確答案：D. 先前接受過腹部手術